下列何者不是延緩慢性腎病進展的治療方式？
A. 低蛋白飲食
B. 控制血壓
C. 非類固醇抗發炎藥物
D. 血管張力素阻斷劑（angiotensin receptor blocker）

正確答案：C. 非類固醇抗發炎藥物